Clinical trial exclusion criterion:
Uncontrolled hypertension (defined as average SBP = 160 mmHg [2 readings taken at time of screening]).

Annotated entities:
- Condition: "hypertension"
- Qualifier: "Uncontrolled"
- Measurement: "average SBP"
- Value: "= 160 mmHg"
- Multiplier: "2 readings"
- Temporal: "at time of screening"
- Reference_point: "screening"